Clinical trial exclusion criterion:
Clinically diagnosed Cushing's disease, acromegaly, gigantism

Annotated entities:
- Qualifier: "Clinically diagnosed"
- Condition: "Cushing's disease"
- Condition: "acromegaly"
- Condition: "gigantism"